Clinical trial inclusion criterion:
Signed informed parental/patient consent form

Annotated entities:
- Informed_consent: "Signed informed parental/patient consent form"